What organism causes Rhombencephalitis?

Rhombencephalitis is caused by Listeria monocytogenes